有關食道閉鎖（esophageal atresia）常合併的畸型，下列何者錯誤？
A. 肛門直腸異常（anorectal malformation）
B. 腎臟及橈骨異常（renal or radius malformation）
C. 小腸閉鎖（intestinal atresia）
D. 脊柱缺損（vertebral defects）

正確答案：C. 小腸閉鎖（intestinal atresia）